Clinical trial inclusion criterion:
Ann Arbor stage II,III or IV

Entity relations:
- Has_value("Ann Arbor stage", "II")
- OR("II", "III", "IV")